Clinical trial exclusion criterion:
Ongoing epilepsy or other seizure disorder, or use of medications for a seizure disorder within 6 months of screening or any time between screening and randomization

Annotated entities:
- Temporal: "Ongoing"
- Condition: "epilepsy"
- Qualifier: "Ongoing"
- Condition: "seizure disorder"
- Qualifier: "other"
- Drug: "medications"
- Condition: "seizure disorder"
- Temporal: "within 6 months of screening"
- Reference_point: "screening"
- Temporal: "any time between screening and randomization"
- Reference_point: "screening"
- Reference_point: "randomization"